Failure of treatment with methylphenidate in the past for apathy after convincing evidence of an adequate trial as judged by study physician

The above is a clinical trial exclusion criterion. Annotated with entity spans:
Failure of treatment with [Drug: methylphenidate] in the past for apathy after convincing evidence of an adequate trial [Subjective_judgement: as judged by study physician]